Subject with known history of intestinal obstruction or current obstructive symptoms, such as severe abdominal pain with accompanying nausea or vomiting, based on investigator judgment.

The above is a clinical trial exclusion criterion. Annotated with entity spans:
Subject with known [Temporal: history] of [Condition: intestinal obstruction] or [Temporal: current] [Condition: obstructive symptoms], such as [Condition: severe abdominal pain] with accompanying [Condition: nausea] or [Condition: vomiting], based on investigator judgment.